對於「豎毛肌（arrector pili muscles）」的敘述，下列何者正確？
A. 由成束骨骼肌構成
B. 由表皮伸展到毛囊（hair follicle）
C. 此肌肉收縮時，會造成「雞皮疙瘩」現象
D. 由成束肌上皮細胞（myoepithelial cell）構成

正確答案：C. 此肌肉收縮時，會造成「雞皮疙瘩」現象